La mayor selectividad de la bromación respecto a la cloración de alcanos puede explicarse recurriendo al:
1. Carácter concertado de la reacción.
2. Postulado de Hammond.
3. Carácter termoneutro de la etapa determinada de la velocidad de bromación.
4. Naturaleza iónica de la etapa determinante de la cinética de la reacción.

Respuesta correcta: 2. Postulado de Hammond.